Clinical trial inclusion criterion:
Subjects undergoing burn excision surgery for standard of care purposes

Entity relations:
- Has_temporal("burn excision surgery", "undergoing")